Clinical trial exclusion criterion:
Known allergic reaction to a histone deacetylase inhibitor

Annotated entities:
- Condition: "allergic reaction"
- Drug: "histone deacetylase inhibitor"